Which are the types of viral meningitis?

Aseptic meningitis is the most common type of meningitis and is characterized by meningeal inflammation that is not linked to identifiable bacterial pathogens in cerebrospinal fluid (CSF). It can be originated from infection from:
1) Varicella-zoster virus (VZV)
2) Herpes simplex types I and II (HSV-1, HSV-2)
3) Epstein-Barr virus (EBV) 
4) Cytomegalovirus (CMV) 
5) Enteroviruses (EV) 
6) Parechoviruses (HPeV) 
7) Human rhinoviruses (HRVs) 
8) Echovirus types 6, 9, 11
9) West Nile Virus (WNV)